Clinical trial inclusion criterion:
Pseudoarthrosis

Annotated entities:
- Condition: "Pseudoarthrosis"